下列何者之受體屬於一種 tyrosine kinase？
A. Norepinephrine
B. GABA
C. Dopamine
D. Insulin

正確答案：D. Insulin